Clinical trial exclusion criterion:
Blood platelet count<100,000/L

Annotated entities:
- Measurement: "Blood platelet count"
- Value: "<100,000/L"